Comorbid major depressive disorder diagnosis which predates OCD diagnosis

The above is a clinical trial exclusion criterion. Annotated with entity spans:
[Qualifier: Comorbid] [Condition: major depressive disorder] diagnosis which [Temporal: predates OCD diagnosis]